What organism causes woolsorter's disease

Woolsorter's disease is caused by the same organism as Anthrax, bacillus Anthrax.